Clinical trial inclusion criterion:
Sepsis due to MDR or minimally susceptible gram-negative bacteria

Annotated entities:
- Condition: "Sepsis"
- Qualifier: "MDR"
- Condition: "minimally susceptible gram-negative bacteria"